Female subjects of non-childbearing potential may be enrolled in the study. Non-childbearing potential is defined as pre-menarche, current bilateral tubal ligation or occlusion, hysterectomy, bilateral ovariectomy or post-menopause.

The above is a clinical trial inclusion criterion. Annotated with entity spans:
[Person: Female] subjects of [Negation: non-][Observation: childbearing potential] may be enrolled in the study. Non-childbearing potential is defined as [Observation: pre-menarche], [Temporal: current] [Condition: bilateral tubal ligation] or occlusion, [Condition: hysterectomy], [Condition: bilateral ovariectomy] or [Observation: post-menopause].